Clinical trial inclusion criterion:
age =18 at screening

Annotated entities:
- Person: "age"
- Value: "=18"